A heart rate less than 50 beats/minute or grade 2 or 3 AV heart block

The above is a clinical trial exclusion criterion. Annotated with entity spans:
A [Measurement: heart rate] [Value: less than 50 beats/minute] or [Qualifier: grade 2] or 3 [Condition: AV heart block]